= 21 years of age at the time of participation.

The above is a clinical trial inclusion criterion. Annotated with entity spans:
[Value: = 21 years] of [Person: age] [Temporal: at the time of participation].